Clinical trial exclusion criterion:
Are pregnant or lactating.

Entity relations:
- OR("pregnant", "lactating")